Clinical trial exclusion criterion:
Has known active central nervous system(CNS) metastases

Annotated entities:
- Condition: "metastases"
- Qualifier: "central nervous system"
- Qualifier: "CNS"